下列何類高血壓藥物最易產生水腫之副作用？
A. 乙型交感神經阻斷劑（β-blockers）
B. 鈣離子阻斷劑（calcium channel blockers）
C. 血管張力素轉換酶抑制劑（angiotensin converting enzyme
D. CE) inhibitors）

正確答案：B. 鈣離子阻斷劑（calcium channel blockers）